Clinical trial exclusion criterion:
history of severe chronic diseases

Entity relations:
- Has_qualifier("chronic diseases", "severe")
- Has_temporal("chronic diseases", "history")